Clinical trial inclusion criterion:
After the investigator has taken the decision to use human insulin or insulin analogues to treat the subject, any type 2 diabetic previously inadequately controlled with two or more OADs is eligible for the study

Entity relations:
- Has_temporal("inadequately controlled", "previously")
- Has_qualifier("type 2 diabetic", "inadequately controlled")
- Has_multiplier("OADs", "two or more")